Clinical trial exclusion criterion:
Previous cardiac surgery (including CABG) within the past 6 months (180 days)

Entity relations:
- Has_temporal("cardiac surgery", "Previous")
- Subsumes("cardiac surgery", "CABG")
- Has_temporal("cardiac surgery", "within the past 6 months (180 days)")